Clinical trial exclusion criterion:
Significant history of drug abuse disorder (including alcohol, as defined in DSM-5 substance use disorder or in the opinion of the investigator) within the last 6 months prior to screening.

Annotated entities:
- Intoxication_considerations: "Significant history of drug abuse disorder (including alcohol, as defined in DSM-5 substance use disorder or in the opinion of the investigator) within the last 6 months prior to screening."